何種絛蟲的幼蟲可以在人體小腸的絨毛內發育？
A. 多房性包生絛蟲（Echinococcus multilocularis）
B. 短小包膜絛蟲（Hymenolepis nana）
C. 廣節裂頭絛蟲（Diphyllobothrium latum）
D. 犬複殖器絛蟲（Dipylidium caninum）

正確答案：B. 短小包膜絛蟲（Hymenolepis nana）